substance abuse/dependence (including alcohol)

The above is a clinical trial exclusion criterion. Annotated with entity spans:
[Condition: substance abuse]/dependence (including [Drug: alcohol])